History of deep vein thrombosis, ischemic heart disease or stroke

The above is a clinical trial exclusion criterion. Annotated with entity spans:
History of [Condition: deep vein thrombosis], [Condition: ischemic heart disease] or [Condition: stroke]